下列有關腎小管對於鈉離子（Na+）再吸收的敘述，何者錯誤？
A. 近端腎小管主要由鈉－葡萄糖共同轉運蛋白（sodium-glucose cotransporter）負責
B. 亨利氏環的上升段粗枝（thick ascending limb of loop of Henle）由鈉－鉀－氯協同轉運蛋白（Na+-K+-2Clcotransporter）負責
C. 亨利氏環的上升段細枝（thin ascending limb of loop of Henle）由上皮鈉通道（epithelial sodium channel）負責
D. 遠曲小管（distal convoluted tubule）由鈉－氯協同轉運蛋白（Na+-Cl- cotransporter）負責

正確答案：C. 亨利氏環的上升段細枝（thin ascending limb of loop of Henle）由上皮鈉通道（epithelial sodium channel）負責